Pathologically proven unresectable adenocarcinoma of stomach

The above is a clinical trial inclusion criterion. Annotated with entity spans:
[Measurement: Pathologically] [Value: proven] [Qualifier: unresectable] [Condition: adenocarcinoma of stomach]